Clinical trial exclusion criterion:
Subject with a history of malignancy within the past 5 years (other than squamous or basal cell skin cancer)

Entity relations:
- Has_negation("squamous skin cancer", "other than")
- Has_temporal("malignancy", "within the past 5 years")
- Has_temporal("malignancy", "history of")
- AND("malignancy", "squamous skin cancer")
- OR("squamous skin cancer", "basal cell skin cancer")